一位75歲男性，半小時前突然右側無力，被送至急診室，下列各種狀況之處置何者較不適當？
A. 立即	血糖，血糖值為30 mg/dL，給予50％葡萄糖溶液
B. 血氧濃度為85％，給予氧氣治療
C. 電腦斷層顯示無腦出血，可考慮使用血栓溶解劑
D. 測量血壓為190/100 mmHg，給予labetalol 10 mg 靜脈注射，以免中風惡化

正確答案：D. 測量血壓為190/100 mmHg，給予labetalol 10 mg 靜脈注射，以免中風惡化